La herramienta de cribado ideada por Stratton y Col (2004) para evaluar la malnutrición en pacientes ingresados en hospitales es:
1. Screening Tool (MUST).
2. CONUT.
3. IMC.
4. Valoración de la ingesta.
5. INFORNUT.

Respuesta correcta: 1. Screening Tool (MUST).